Clinical trial exclusion criterion:
Active or history of any clinically significant medical condition including renal, hepatic, pulmonary, gastrointestinal, cardiovascular, genitourinary, endocrine, immunologic, metabolic, neurologic, psychiatric or hematological disease, based on Investigator judgment.

Entity relations:
- Has_qualifier("medical condition", "clinically significant")
- Subsumes("medical condition", "hematological disease")
- Has_temporal("medical condition", "Active")
- Has_qualifier("clinically significant", "based on Investigator judgment")
- Subsumes("medical condition", "metabolic disease")
- OR("Active", "history")
- OR("metabolic disease", "disease renal", "disease pulmonary", "psychiatric disease", "disease immunologic", "disease cardiovascular", "neurologic disease", "disease gastrointestinal", "disease genitourinary", "disease endocrine", "disease hepatic")